Patients should have been off other investigational antineoplastic therapy for one month prior to entry in this study.

The above is a clinical trial inclusion criterion. Annotated with entity spans:
[Post-eligibility: Patients should have been off other investigational antineoplastic therapy for one month prior to entry in this study.]